3. Be in good health.

The above is a clinical trial inclusion criterion. Annotated with entity spans:
[Parsing_Error: 3.] Be in [Condition: good health].